Las reclamaciones de los pacientes o de sus familiares que se reciben en las Unidades de Atención al Usuario son un indicador de calidad, pero ¿qué componente de la calidad miden?
1. La calidad de la atención de la Unidad de Atención al Usuario.
2. La calidad extrínseca o percibida.
3. La calidad del tratamiento de los pacientes en términos de adherencia a las guías de Buena Práctica Clínica.
4. La calidad intrínseca o científico-técnica.

Respuesta correcta: 2. La calidad extrínseca o percibida.